Non-pregnant, non-lactating female patients, whose screening pregnancy test is negative and who are using contraceptive methods deemed reliable by the investigator, or who are at least 2 years post-menopausal or surgically sterilized.

The above is a clinical trial inclusion criterion. Annotated with entity spans:
[Negation: Non]-[Condition: pregnant], [Negation: non]-[Condition: lactating] [Person: female] patients, whose screening [Measurement: pregnancy test] is [Value: negative] and who are using [Device: contraceptive methods] [Subjective_judgement: deemed reliable by the investigator], or who are [Temporal: at least 2 years] [Condition: post-menopausal] or [Condition: surgically sterilized].